What genes is implicated in myotonic goats and other  nondystrophic myotonias?

Myotonic goats and other Nondystrophic Myotonias are caused by mutations in either the CLCN1 gene in Myotonia congenita or in the SCN4A gene in S4A.